Able to operate a patient-controlled analgesia device (PCA)

The above is a clinical trial inclusion criterion. Annotated with entity spans:
Able to operate a [Device: patient-controlled analgesia device] ([Device: PCA])